major illness

The above is a clinical trial exclusion criterion. Annotated with entity spans:
[Qualifier: major] [Condition: illness]